Patients presenting for elective posterior spinal fusion surgery (lower thoracic, lumbar, sacral)

The above is a clinical trial inclusion criterion. Annotated with entity spans:
Patients presenting for [Qualifier: elective] [Procedure: posterior spinal fusion surgery] ([Qualifier: lower thoracic], [Qualifier: lumbar], [Qualifier: sacral])